Clinical trial exclusion criterion:
Pregnant, lactating, or intending to become pregnant during the study.

Annotated entities:
- Condition: "Pregnant"
- Condition: "lactating"
- Mood: "intending to become"
- Condition: "pregnant"
- Temporal: "during the study"